Any prior exposure to HCV protease inhibitor therapy

The above is a clinical trial exclusion criterion. Annotated with entity spans:
Any prior exposure to [Procedure: HCV protease inhibitor therapy]